¿Además del número de verdaderos negativos (VN), cuál de las opciones es necesaria para calcular la especificidad?
1. Verdaderos positivos.
2. Prevalencia.
3. Falsos negativos.
4. Falsos positivos.

Respuesta correcta: 4. Falsos positivos.